VAS leg pain of at least 40/100 at baseline.

The above is a clinical trial inclusion criterion. Annotated with entity spans:
[Measurement: VAS leg pain] of [Value: at least 40/100] [Temporal: at baseline].